18 years of age or older;

The above is a clinical trial inclusion criterion. Annotated with entity spans:
[Value: 18 years] of [Person: age] or older;